Clinical trial exclusion criterion:
Severe daytime sleepiness, defined as Epworth Sleepiness Scale score 18 or higher or a report of falling asleep driving during the previous year, and deemed a safety risk by study physician

Annotated entities:
- Condition: "daytime sleepiness"
- Measurement: "Epworth Sleepiness Scale"
- Value: "score 18 or higher"
- Non-query-able: "a report of falling asleep driving during the previous year, and deemed a safety risk by study physician"